Clinical trial exclusion criterion:
History of or intercurrent diphtheria, tetanus, pertussis, hepatitis B, polio, and Haemophilus influenzae type b diseases.

Annotated entities:
- Temporal: "History"
- Condition: "diphtheria"
- Condition: "tetanus"
- Condition: "pertussis"
- Condition: "hepatitis B"
- Condition: "polio"
- Condition: "Haemophilus influenzae type b"